Clinical trial exclusion criterion:
Treatment with statins during the past month prior to study.

Annotated entities:
- Drug: "statins"
- Temporal: "during the past month prior to study"
- Reference_point: "the past month prior to study"